De los siguientes anticoagulantes cual es un inhibidor directo de la trombina:
1. Dabigatran.
2. Apixaban.
3. Ribaroxaban.
4. Acenocumarol.
5. Clopidogrel.

Respuesta correcta: 1. Dabigatran.